Clinical trial inclusion criteria:
Patients with symptomatic FAI
Clinical and radiographic evidence of FAI
Patients able to provide consent to study participation
Completion of 6 weeks of physical therapy program

Annotated entities:
- Condition: "FAI"
- Qualifier: "symptomatic"
- Condition: "FAI"
- Qualifier: "radiographic evidence"
- Qualifier: "Clinical evidence"
- Post-eligibility: "Patients able to provide consent to study participation"
- Procedure: "physical therapy program"
- Temporal: "6 weeks"